Malignancy

The above is a clinical trial exclusion criterion. Annotated with entity spans:
[Condition: Malignancy]